Clinical trial exclusion criteria:
Prior treatment with a bisphosphonate
Abnormal renal function as evidenced by a calculated creatinine clearance < 30 ml/minute.
Corrected (adjusted for serum albumin) serum calcium concentration < 8.0 mg/dl (2.00 mmol/L) or ≥ 12.0 mg/dl (3.00 mmol/L).
Patients with clinically symptomatic brain metastases
History of diseases with influence on bone metabolism such as Paget's disease and primary hyperparathyroidism
Severe physical or psychological concomitant diseases that might impair compliance with the provisions of the study protocol or that might impair the assessment of drug or patient safety, e.g. clinically significant ascites, cardiac failure, NYHA III or IV, clinically relevant pathologic findings in ECG
Known hypersensitivity to zoledronic acid or other bisphosphonates
Use of other investigational drugs 30 days prior to the date of randomization
Known history or present abuse of alcohol or drugs
Subjects who, in the opinion of the investigator, are unlikely to cooperate fully during the study
Current active dental problems including infection of the teeth or jawbone (maxilla or mandibular); dental or fixture trauma, or a current or prior diagnosis of osteonecrosis of the jaw (ONJ), of exposed bone in the mouth, or of slow healing after dental procedures.
Recent (within 6 weeks) or planned dental or jaw surgery (e.g. extraction, implants)
Other protocol defined inclusion/exclusion criteria may apply.

Annotated entities:
- Drug: "bisphosphonate"
- Temporal: "Prior"
- Measurement: "renal function"
- Value: "Abnormal"
- Measurement: "calculated creatinine clearance"
- Value: "< 30 ml/minute"
- Measurement: "Corrected serum calcium concentration"
- Value: "< 8.0 mg/dl"
- Value: "2.00 mmol/L"
- Value: "≥ 12.0 mg/dl"
- Value: "3.00 mmol/L"
- Observation: "clinically symptomatic"
- Condition: "brain metastases"
- Temporal: "History"
- Condition: "diseases with influence on bone metabolism"
- Condition: "Paget's disease"
- Condition: "primary hyperparathyroidism"
- Condition: "physical diseases"
- Condition: "psychological diseases"
- Condition: "ascites"
- Qualifier: "clinically significant"
- Condition: "cardiac failure"
- Measurement: "NYHA"
- Value: "III or IV"
- Qualifier: "clinically relevant"
- Observation: "pathologic findings"
- Procedure: "ECG"
- Condition: "hypersensitivity"
- Drug: "zoledronic acid"
- Drug: "other bisphosphonates"
- Drug: "other investigational drugs"
- Temporal: "30 days prior to the date of randomization"
- Temporal: "history"
- Temporal: "present"
- Condition: "abuse of alcohol"
- Condition: "abuse of drugs"
- Non-query-able: "Subjects who, in the opinion of the investigator, are unlikely to cooperate fully during the study"
- Condition: "dental problems"
- Temporal: "Current"
- Condition: "infection of the teeth"
- Condition: "infection of the jawbone"
- Condition: "infection of the maxilla"
- Condition: "infection of the mandibular"
- Condition: "dental trauma"
- Condition: "fixture trauma"
- Temporal: "current"
- Temporal: "prior"
- Condition: "osteonecrosis of the jaw (ONJ)"
- Condition: "exposed bone in the mouth"
- Condition: "slow healing after dental procedures"
- Temporal: "within 6 weeks"
- Temporal: "Recent"
- Mood: "planned"
- Procedure: "dental surgery"
- Procedure: "jaw surgery"
- Procedure: "extraction"
- Procedure: "implants"
- Non-representable: "Other protocol defined inclusion/exclusion criteria may apply."